Clinical trial inclusion criterion:
barrier contraceptives (condom, diaphragm with spermicide)

Entity relations:
- Has_qualifier("diaphragm", "with spermicide")
- Subsumes("barrier contraceptives", "condom")
- OR("condom", "diaphragm")